Currently in active alcohol withdrawal

The above is a clinical trial exclusion criterion. Annotated with entity spans:
[Temporal: Currently] in [Qualifier: active] [Condition: alcohol withdrawal]